Clinical trial exclusion criterion:
Any prior exposure to HCV protease inhibitor therapy

Annotated entities:
- Procedure: "HCV protease inhibitor therapy"